Clinical trial inclusion criterion:
Signed informed consent prior to surgery

Annotated entities:
- Informed_consent: "Signed informed consent prior to surgery"